Clinical trial exclusion criterion:
Pregnant, lactating, or intending to become pregnant during the study.

Entity relations:
- Has_mood("pregnant", "intending to become")
- Has_temporal("pregnant", "during the study")
- OR("Pregnant", "lactating", "pregnant")